Clinical trial exclusion criterion:
Is a prisoner

Annotated entities:
- Person: "prisoner"